Clinical trial exclusion criterion:
Pregnancy or breast feeding.

Annotated entities:
- Condition: "Pregnancy"
- Observation: "breast feeding"